Is the long non- coding RNA malat-1 up or downregulated in cancer?

Malat-1 expression is upregulated in several tumor types